Clinical trial inclusion criterion:
Patients must complain of mild to moderate arthralgia.

Annotated entities:
- Condition: "arthralgia"
- Qualifier: "moderate"
- Qualifier: "mild"